Cervical dilation >1.5 cm and/or visible membranes by pelvic exam

The above is a clinical trial exclusion criterion. Annotated with entity spans:
[Measurement: Cervical dilation] [Value: >1.5 cm] and/or [Condition: visible membranes] by [Procedure: pelvic exam]